Clinical trial inclusion criterion:
Minimum MADRS score = 15.

Entity relations:
- Has_value("MADRS score", "Minimum = 15")